A que trastorno corresponde la presencia de síntomas como los siguientes: estado general de confusión, desorientación espacial, personal y temporal, polineuropatías, incapacidad para reconocer a personas familiares y graves problemas de atención y memoria:
1. Confabulación.
2. Síndrome de Munchausen.
3. Fase de Wernicke.
4. Síndrome de Pollystoff.

Respuesta correcta: 3. Fase de Wernicke.